下列何種治療乳癌藥物中，對女性乳癌具有專一性的作用？
A. Doxorubicin
B. Trastuzumab
C. Anastrozole
D. Fluoxymesterone

正確答案：B. Trastuzumab